干擾素（interferons, Type I and II）具有對抗病毒與誘發免疫反應之作用，其中那一型干擾素對於提升人類免疫功能最強？
A. δ
B. γ
C. β
D. α

正確答案：B. γ